Bilirubin < 20.0mg/dL (if Gilberts then < 2.5 mg/dL) and AST/AST < 2.5 ULN

The above is a clinical trial inclusion criterion. Annotated with entity spans:
[Measurement: Bilirubin] [Value: < 20.0mg/dL] (if [Condition: Gilberts] then [Value: < 2.5 mg/dL]) and [Measurement: AST/AST] [Value: < 2.5 ULN]